Clinical trial inclusion criterion:
Metastatic disease

Annotated entities:
- Condition: "Metastatic disease"